Clinical trial exclusion criterion:
Infection at or near the intended needle insertion site

Entity relations:
- Has_qualifier("Infection", "intended needle insertion site")